Clinical trial inclusion criterion:
two or more licensed NRTIs

Entity relations:
- Has_qualifier("NRTI", "licensed")
- Has_multiplier("NRTI", "two or more")